下列何類病人發生無症狀性菌尿症（asymptomatic bacteriuria）時最需要給予抗生素治療？
A. 孕婦
B. 罹患結核症的老年人
C. 有留置導尿管者
D. 糖尿病患者

正確答案：A. 孕婦